Clinical trial exclusion criterion:
2. Enhanced risk from lumbar puncture, including documented or suspected cerebral mass lesion predisposing to brain herniation or bleeding diathesis.

Entity relations:
- Has_mood("lumbar puncture", "Enhanced risk")
- Has_mood("brain herniation", "predisposing to")
- multi("predisposing to brain herniation or bleeding diathesis", "brain herniation")
- Has_qualifier("cerebral mass lesion", "predisposing to brain herniation or bleeding diathesis")
- Has_mood("cerebral mass lesion", "documented")
- Subsumes("lumbar puncture", "cerebral mass lesion")
- OR("brain herniation", "bleeding diathesis")
- OR("documented", "suspected")